Clinical trial inclusion criterion:
major depressive episode in type2 bipolar disorder or bipolar disorder NOS.(MADRS more than 20 point)

Annotated entities:
- Condition: "major depressive episode"
- Condition: "type2 bipolar disorder"
- Condition: "bipolar disorder"
- Qualifier: "NOS"
- Measurement: "MADRS"
- Value: "more than 20 point"